Clinical trial exclusion criterion:
Excess alcohol intake (males: = 28 units/week, females: = 21 units/week. One unit of alcohol = 8 oz beer, 1 oz hard liquor or 4 oz wine).

Annotated entities:
- Measurement: "alcohol intake"
- Person: "males"
- Value: "= 28 units/week"
- Value: "Excess"
- Person: "females"
- Value: "= 21 units/week"
- Non-representable: "One unit of alcohol = 8 oz beer, 1 oz hard liquor or 4 oz wine"